At least one patent (less than 50 percent stenosed) tibioperoneal runoff vessel.

The above is a clinical trial inclusion criterion. Annotated with entity spans:
[Multiplier: At least one] [Condition: patent] (less than 50 percent stenosed) tibioperoneal runoff vessel.